2hr glucose during OGTT >200 mg/dL

The above is a clinical trial exclusion criterion. Annotated with entity spans:
[Measurement: 2hr glucose during OGTT] [Value: >200 mg/dL]